Clinical trial exclusion criterion:
Ongoing treatment with Beta blockers, Diuretic;

Annotated entities:
- Drug: "Beta blockers"
- Temporal: "Ongoing"
- Procedure: "treatment"
- Drug: "Diuretic"